Serum bilirubin: ≤ 1.2 mg/dL

The above is a clinical trial inclusion criterion. Annotated with entity spans:
[Measurement: Serum bilirubin]: [Value: ≤ 1.2 mg/dL]